¿Cuál es la afirmación correcta sobre las intervenciones paradójicas?:
1. Pueden incluir la prescripción de no cambio.
2. Consisten en debatir con el paciente lo paradójico de su actitud con respecto al cambio.
3. Su origen es la Terapia Sistémica.
4. Han sido incluidas por la psicoterapia psicodinámica para conseguir mayor brevedad.
5. Están contraindicadas en casos de resistencia.

Respuesta correcta: 1. Pueden incluir la prescripción de no cambio.